As of 2019, what type of cancer is commonly associated with ionizing radiation

Breast cancer, multiple myeloma, leukaemia and osteosarcoma are examples of cancers that are commonly associated with ionizing radiation.